Clinical trial exclusion criterion:
cancer as the reason for intestinal failure

Annotated entities:
- Condition: "cancer"
- Condition: "intestinal failure"